History of fainting or other significant adverse reaction during phlebotomy or donation of blood

The above is a clinical trial exclusion criterion. Annotated with entity spans:
History of [Condition: fainting] or other significant [Condition: adverse reaction] during [Procedure: phlebotomy] or [Observation: donation of blood]